Clinical trial exclusion criterion:
Drug and alcohol abuse

Entity relations:
- OR("Drug abuse", "alcohol abuse")